Subjects of STEMI who underwent primary PCI within the first 12 hours.

The above is a clinical trial inclusion criterion. Annotated with entity spans:
Subjects of [Condition: STEMI] who underwent [Procedure: primary PCI] [Temporal: within the first 12 hours.]